Clinical trial inclusion criterion:
Multiple gated acquisition (MUGA), echocardiogram, cardiac MRI, and/or pulmonary function tests (PFT) performed and reviewed by transplant center (for individuals with an ejection fraction and diffusing capacity [DLCO] of 40-50%, the appropriate cardiology or pulmonary consultations should be considered if the individual has severe heart or lung disease at the initiation of therapy)

Annotated entities:
- Procedure: "Multiple gated acquisition (MUGA)"
- Procedure: "echocardiogram"
- Procedure: "cardiac MRI"
- Procedure: "pulmonary function tests (PFT)"
- Qualifier: "reviewed by transplant center"